關於kwashiorkor malnutrition的敘述，何者最不適當？
A. 是長期飢餓的結果（starvation-related malnutrition）
B. 身體診察可能發現水腫、頭髮容易拔出（easy hair pluckability）
C. 實	室檢查可能發現血清白蛋白低（＜2.8 g/dL）、血液淋巴球減少（lymphocytes＜1,500/µL）
D. Body mass index仍在正常範圍

正確答案：A. 是長期飢餓的結果（starvation-related malnutrition）